Ongoing use of other psoriasis treatment including but not limited to topical or systemic corticosteroids, other topical medications (i.e. coal tar), oral or biologic medications for the treatment of psoriasis, and UV therapy. The following washout periods will be required: 2 weeks for topical therapy; 2 weeks for phototherapy; 12 weeks for biologic or targeted therapies; 4 weeks for other systemic therapies

The above is a clinical trial exclusion criterion. Annotated with entity spans:
[Temporal: Ongoing] use of other [Condition: psoriasis] [Procedure: treatment] including but not limited to [Drug: topical] or [Drug: systemic corticosteroids], other [Drug: topical medications] (i.e. [Drug: coal tar]), [Drug: oral] or [Drug: biologic medications] for the treatment of psoriasis, and [Procedure: UV therapy]. [Non-representable: The following washout periods will be required: 2 weeks for topical therapy; 2 weeks for phototherapy; 12 weeks for biologic or targeted therapies; 4 weeks for other systemic therapies]